Los métodos voltamperométricos de redisolución anódica:
1. Se basan en la preconcentración de analitos en la superficie de un electrodo y se caracterizan por su baja sensibilidad, ya que la superficie del electrodo es muy pequeña.
2. Se aplican exclusivamente a la determinación de trazas de metales por oxidación sobre un electrodo de mercurio.
3. Requieren la aplicación de una etapa de acumulación y otra de redisolución en la que se registran curvas intensidad-tiempo.
4. Se utilizan para la determinación de metales que, una vez depositados, se oxidan electroquímicamente.
5. Se basan en la variación del potencial que experimenta el electrodo de trabajo a medida que se redisuelve la sustancia depositada.

Respuesta correcta: 4. Se utilizan para la determinación de metales que, una vez depositados, se oxidan electroquímicamente.